Clinical trial inclusion criterion:
self-reported healthy adults between the ages of 18-60 who are fluent in English.

Entity relations:
- Has_value("ages", "between 18-60")
- Has_qualifier("healthy", "self-reported")